Clinical trial inclusion criterion:
Diagnosis of heart failure according to Framingham criteria

Entity relations:
- Has_qualifier("heart failure", "Framingham criteria")